Clinical trial exclusion criterion:
Presence or history of relevant hepatic disease as judged by the investigator

Annotated entities:
- Subjective_judgement: "as judged by the investigator"
- Condition: "hepatic disease"
- Qualifier: "relevant"
- Parsing_Error: "Presence or history"